El factor p53 induce:
1. Supervivencia.
2. Proliferación.
3. Senescencia.
4. Apoptosis.
5. Crecimiento.

Respuesta correcta: 4. Apoptosis.